6. Lifetime history of major depressive disorder, schizophrenia, bipolar disorder, mania, or hypomania.

The above is a clinical trial exclusion criterion. Annotated with entity spans:
[Parsing_Error: 6.] [Temporal: Lifetime history of] [Condition: major depressive disorder], [Condition: schizophrenia], [Condition: bipolar disorder], [Condition: mania], or [Condition: hypomania].